dysphagia

The above is a clinical trial exclusion criterion. Annotated with entity spans:
[Condition: dysphagia]